Which disorder is caused by biallelic mutations in G-Protein coupled receptor kinase 1 (GRK1)?

Biallelic mutations in G-Protein coupled receptor kinase 1 (GRK1) cause Oguchi disease, a rare subtype of congenital stationary night blindness (CSNB), which is caused by a protein-coupled receptor-protein interaction.